¿Cuál es el mecanismo de acción de octreótida?:
1. Agonista del receptor serotonérgico 5-HT4.
2. Agonista del receptor de la motilina.
3. Agonista del receptor de somatostatina.
4. Antagonista del receptor de motilina.
5. Antagonista del receptor de somatostatina.

Respuesta correcta: 3. Agonista del receptor de somatostatina.